Clinical trial inclusion criterion:
T2DM: Diagnosed according to the WHO criteria [53].

Entity relations:
- Has_qualifier("T2DM", "WHO criteria")